Clinical trial exclusion criterion:
Neonatal intensive care unit admission

Annotated entities:
- Visit: "Neonatal intensive care unit"